Type 1 diabetes (autoantibody positive).

The above is a clinical trial exclusion criterion. Annotated with entity spans:
[Condition: Type 1 diabetes] ([Measurement: autoantibody] [Value: positive]).